Clinical trial inclusion criterion:
IUD or Depo PLUS a barrier contraceptive

Entity relations:
- OR("IUD", "Depo")